Clinical trial exclusion criterion:
Severe renal impairment

Annotated entities:
- Condition: "renal impairment"
- Qualifier: "Severe"